Clinical trial exclusion criterion:
Patients that do not have a valid Ontario Health Insurance Plan (OHIP) number at time of first transfusion

Entity relations:
- Has_negation("have a valid Ontario Health Insurance Plan (OHIP) number", "not")
- Has_index("at time of first transfusion", "first transfusion")
- Has_multiplier("transfusion", "first")
- multi("first transfusion", "transfusion")
- Has_temporal("have a valid Ontario Health Insurance Plan (OHIP) number", "at time of first transfusion")